Clinical trial exclusion criterion:
Any metal in or on the body (that cannot be removed) between the nose and the abdomen

Annotated entities:
- Device: "metal in the body"
- Device: "metal on the body"
- Qualifier: "between the nose and the abdomen"